Clinical trial exclusion criterion:
Diagnosis of a primary or secondary HA disorder other than PTHA

Annotated entities:
- Qualifier: "primary"
- Qualifier: "secondary"
- Condition: "HA disorder"
- Condition: "PTHA"
- Negation: "other than"